No major fetal malformations

The above is a clinical trial inclusion criterion. Annotated with entity spans:
[Negation: No] [Condition: major fetal malformations]